What is the role of Acyl-Homoserine Lactone  in bacteria?

Some bacteria use a class of chemical compounds called acyl-homoserine lactones (AHLs) as quorum sensing (QS) signals to coordinate their behavior at the population level.